Clinical trial exclusion criterion:
Any intraocular inflammation in the study eye present during the screening slit lamp examination

Annotated entities:
- Condition: "intraocular inflammation"
- Temporal: "during the screening slit lamp examination"
- Reference_point: "the screening slit lamp examination"
- Procedure: "slit lamp examination"
- Value: "intraocular inflammation"